Clinical trial exclusion criterion:
Other investigational procedure <=30 days before study entry.

Annotated entities:
- Temporal: "<=30 days before study entry"
- Qualifier: "Other"
- Procedure: "investigational procedure"